Clinical trial inclusion criterion:
Men of the family of index case

Annotated entities:
- Not_a_criteria: "Men of the family of index case"